Clinical trial exclusion criterion:
The use of weight-lowering drugs, any investigational blood-glucose or lipid-lowering agent (other than statins or ezetimibe) within the past 3 months

Entity relations:
- Has_qualifier("drugs", "weight-lowering")
- Has_qualifier("agent", "blood-glucose")
- Has_qualifier("agent", "investigational")
- Has_negation("statins", "other")
- Has_temporal("drugs", "past 3 months")
- OR("blood-glucose", "lipid-lowering")
- OR("drugs", "agent")
- OR("statins", "ezetimibe")